Clinical trial exclusion criterion:
Primary renal impairment, creatinine clearance < 45 ml/min if treated with metformin.

Annotated entities:
- Condition: "Primary renal impairment"
- Measurement: "creatinine clearance"
- Value: "< 45 ml/min"
- Drug: "metformin"